Clinical trial exclusion criterion:
Patients with severe cardiac conditions: heart failure (NYHA Class 3 or 4), history of ischemic cardiac disease (unstable angina, myocardial infarction), peripheral vascular diseases, percutaneous transluminal angioplasty or coronary artery bypass graft within recent 6 months.

Entity relations:
- Has_qualifier("cardiac conditions", "severe")
- Has_value("NYHA", "Class 3 or 4")
- Has_temporal("ischemic cardiac disease", "history")
- Has_temporal("percutaneous transluminal angioplasty", "within recent 6 months")
- Subsumes("ischemic cardiac disease", "percutaneous transluminal angioplasty")
- AND("heart failure", "NYHA")
- Subsumes("cardiac conditions", "heart failure")
- OR("percutaneous transluminal angioplasty", "coronary artery bypass graft")
- OR("unstable angina", "peripheral vascular diseases", "myocardial infarction", "percutaneous transluminal angioplasty")
- OR("heart failure", "ischemic cardiac disease")